Clinical trial inclusion criterion:
Prevalent NHHD patients who have received >1 year dialysis with unfractionated heparin as anticoagulant

Entity relations:
- Subsumes("unfractionated heparin", "anticoagulant")
- AND("dialysis", "unfractionated heparin")
- Has_temporal("dialysis", ">1 year")